¿Qué trastorno se caracteriza por la presencia recurrente de atracones en ausencia de estrategias o comportamientos compensatorios inadecuados?:
1. Anorexia Nerviosa.
2. Bulimia Nerviosa.
3. Trastorno por Atracón.
4. Hiperfagia.

Respuesta correcta: 3. Trastorno por Atracón.